Patient has history of loose or watery stools

The above is a clinical trial exclusion criterion. Annotated with entity spans:
Patient has [Temporal: history of] [Condition: loose] or [Condition: watery stools]